10個月大的男嬰高燒6天，軀幹及四肢可見皮膚紅疹且手腳腫脹，結膜充血發紅，同時有草莓舌及嘴唇乾裂，在頸部可摸到淋巴結腫大，下列何者錯誤？
A. 最可能的診斷是川崎氏症（Kawasaki disease）
B. 治療可使用口服Aspirin
C. 若此病人使用IVIG 2g/kg治療，於1歲1個月時可施打水痘疫苗
D. 需安排心臟超音波檢查

正確答案：C. 若此病人使用IVIG 2g/kg治療，於1歲1個月時可施打水痘疫苗